Clinical trial exclusion criterion:
Heart disease or heart rhythm disorder or taking anti-arrhythmic drugs

Annotated entities:
- Condition: "Heart disease"
- Condition: "heart rhythm disorder"
- Drug: "anti-arrhythmic drugs"